下列關於 Klippel-Feil syndrome 的敘述，何者錯誤？
A. 兩節或多節頸椎先天性融合（Congenital fusion）
B. 低髮際（Low posterior hairline）
C. 頸部較長（Long neck）
D. 頸椎活動受限

正確答案：C. 頸部較長（Long neck）